紅血球生成過程中，下列何者不再具有分裂能力？
A. 正母紅血球（normoblasts）
B. 前母紅血球（proerythroblasts）
C. 嗜鹼性母紅血球（basophilic erythroblasts）
D. 多染性母紅血球（polychromatophilic erythroblasts）

正確答案：A. 正母紅血球（normoblasts）